Clinical trial exclusion criterion:
Sickle cell disease

Annotated entities:
- Condition: "Sickle cell disease"